15天大女嬰實	數值顯示Free T4 0.32 ng/dL（正常值：0.8～2 ng/dL）、T4 2.2 µg/dL（正常值：4.5～12.5 µg/dL）、TSH 102 mIU/L（正常值：1.0～15.0 mIU/L），下列敘述何者最正確？
A. 為甲狀腺功能亢進之個案
B. 這類疾病多為自體隱性遺傳導致
C. 可能與先天性甲狀腺發育不良有關
D. 身體診察可發現女嬰前囟門已癒合

正確答案：C. 可能與先天性甲狀腺發育不良有關